Use of neuroleptics

The above is a clinical trial exclusion criterion. Annotated with entity spans:
Use of [Drug: neuroleptics]